Clinical trial inclusion criterion:
Best corrected visual acuity 20/32 - 20/320

Annotated entities:
- Measurement: "Best corrected visual acuity"
- Value: "20/32 - 20/320"